What is the mechanism of action of Lanifibranor?

Lanifibranor is peroxisome proliferator-activated receptor (PPAR) agonist.